下列關於鐵（iron）的吸收之敘述，何者正確？
A. 食物中的鐵離子可百分之百的被吸收
B. 以載體（transporter）運輸的方式被吸收
C. 主要以Fe3+的形式吸收
D. 酸性環境抑制鐵的吸收

正確答案：B. 以載體（transporter）運輸的方式被吸收